Clinical trial exclusion criterion:
mRS=2;

Annotated entities:
- Measurement: "mRS"
- Value: "=2"